有關兒童 DKA（diabetic ketoacidosis）之敘述，下列何者錯誤？
A. 大多發生於肥胖小孩
B. 常以噁心、嘔吐和腹痛表現
C. 血中 pH 值小於 7.25 至 7.30
D. 呼吸以深快表現

正確答案：A. 大多發生於肥胖小孩